Clinical trial inclusion criteria:
Age > 50 years
Smoking history > 10 packs/year
FEV1 30 - 79% of predicted and FEV1/FVC < 70% (GOLD 2-3)
FRC > 120 % predicted
Borg dyspnea score > 3 during the 3-min constant rate shuttle walking test at V3

Annotated entities:
- Person: "Age"
- Value: "> 50 years"
- Measurement: "Smoking history"
- Value: "> 10 packs/year"
- Measurement: "FEV1"
- Value: "30 - 79% of predicted"
- Measurement: "FEV1/FVC"
- Value: "< 70%"
- Measurement: "GOLD"
- Value: "2-3"
- Measurement: "FRC"
- Value: "> 120 % predicted"
- Measurement: "Borg dyspnea score"
- Value: "> 3"
- Temporal: "3-min constant rate shuttle walking test"
- Qualifier: "V3"